History or other evidence of chronic pulmonary disease associated with functional limitation. Severe cardiac disease (e.g., NYHA Functional Class III or IV, myocardial infarction within 6 months, ventricular tachyarrhythmias requiring ongoing treatment, unstable angina or other significant cardiovascular diseases).

The above is a clinical trial exclusion criterion. Annotated with entity spans:
History or other evidence of [Condition: chronic pulmonary disease] associated with [Condition: functional limitation]. [Qualifier: Severe] [Condition: cardiac disease] (e.g., [Measurement: NYHA] [Value: Functional Class III or IV], [Condition: myocardial infarction] [Temporal: within 6 months], [Condition: ventricular tachyarrhythmias] requiring [Temporal: ongoing] [Procedure: treatment], [Condition: unstable angina] or [Qualifier: other] [Qualifier: significant] [Condition: cardiovascular diseases]).